Clinical trial inclusion criteria:
Healthy postmenopausal women with 50 or more moderate to severe hot flushes.
Women between 40 to 70 years of age.

Annotated entities:
- Condition: "postmenopausal"
- Condition: "Healthy"
- Person: "women"
- Value: "50 or more"
- Condition: "moderate to severe hot flushes"
- Person: "Women"
- Value: "between 40 to 70 years"
- Person: "age"